Clinical trial exclusion criterion:
Evidence of alcohol abuse or history of alcohol abuse or illegal and/or legally prescribed drugs.

Annotated entities:
- Condition: "alcohol abuse"
- Condition: "alcohol abuse"
- Temporal: "history"
- Condition: "abuse illegal drugs"
- Condition: "abuse legally prescribed drugs"